Clinical trial exclusion criterion:
Receipt of any vaccine in the 4 weeks preceding each trial vaccination or planned receipt of any vaccine in the 4 weeks following each trial vaccination, except for:

Annotated entities:
- Drug: "vaccine"
- Temporal: "in the 4 weeks preceding each trial vaccination"
- Reference_point: "each trial vaccination"
- Temporal: "in the 4 weeks following each trial vaccination"
- Reference_point: "each trial vaccination"
- Mood: "planned receipt"
- Drug: "vaccine"
- Parsing_Error: "except for:"
- Negation: "except for"